Use of any of the following treatments or any other alternative therapy within 2 weeks of the pre-treatment PET scan that may have beneficial effects on mood, including St John's Wort, S-adenosyl methionine (SAMe), n-3 fatty acids, or light therapy.

The above is a clinical trial exclusion criterion. Annotated with entity spans:
Use of any of the following [Procedure: treatments] or any other [Procedure: alternative therapy] [Temporal: within 2 weeks of the pre-treatment PET scan] that may have beneficial effects on [Condition: mood], including [Drug: St John's Wort], [Drug: S-adenosyl methionine] ([Drug: SAMe]), [Drug: n-3 fatty acids], or [Procedure: light therapy].